Clinical trial exclusion criterion:
Uncontrollable hypotension when upright

Annotated entities:
- Condition: "hypotension"
- Qualifier: "Uncontrollable"
- Qualifier: "when upright"